下列有關主動脈剝離（aortic dissection）之敘述，何者錯誤？
A. 主動脈剝離病人往往合併有高血壓或主動脈瓣膜疾病
B. 診斷的方式包含主動脈攝影、食道超音波、電腦斷層或核磁共振，診斷的sensitivity及specificity皆有80%以  	上
C. 凡是急性升主動脈剝離（acute type A aortic dissection），需要馬上接受手術治療
D. 在 type A或type B主動脈剝離產生的器官灌注不良（mal-perfusion syndrome）中，以腦部及腸道最常見

正確答案：D. 在 type A或type B主動脈剝離產生的器官灌注不良（mal-perfusion syndrome）中，以腦部及腸道最常見